Clinical trial inclusion criteria:
>= 18 years old the day of inclusion
Pregnancy
Positive HBs Ag
Informed consent obtained with information sheet given and explained and the consent form signed by the participant of the project investigator at the latest the day of the inclusion

Annotated entities:
- Person: "old"
- Value: ">= 18 years"
- Condition: "Pregnancy"
- Measurement: "HBs Ag"
- Value: "Positive"
- Informed_consent: "Informed consent obtained with information sheet given and explained and the consent form signed by the participant of the project investigator at the latest the day of the inclusio"